Clinical trial inclusion criteria:
female infertile patients eligible for IVF treatment

Annotated entities:
- Person: "female"
- Condition: "infertile"
- Mood: "eligible"
- Procedure: "IVF treatment"